Ante un hombre de 49 años, asintomático, con el antecedente familiar de padre fallecido por cáncer de próstata, que en un control rutinario de empresa se identifica un PSA (Antígeno Prostático Específico) de 5,9 ng/ml, con un cociente de PSA libre/PSA total del 11% y que en un tacto rectal se aprecia aumento de consistencia en el lóbulo derecho prostático, ¿cuál es la siguiente indicación clínica?
1. Plantear al paciente la realización de una ecografía transrectal y biopsia prostática.
2. Realizar un TAC abdominopélvico.
3. Iniciar tratamiento con Inhibidores de la 5 alfa Reductasa para reducir a la mitad los niveles del PSA.
4. Iniciar tratamiento combinado de análogos de la LHRH y antiandrógenos.
5. Realizar una gammagrafía ósea.

Respuesta correcta: 1. Plantear al paciente la realización de una ecografía transrectal y biopsia prostática.